胃飽足的感覺主要由下列何者攜帶？
A. 內臟大神經（greater splanchnic nerve）
B. 內臟小神經（lesser splanchnic nerve）
C. 內臟最小神經（least splanchnic nerve）
D. 迷走神經（vagus nerve）

正確答案：D. 迷走神經（vagus nerve）